What is being measured with an accelerometer in back pain patients

Accelerometer assessment measuring overall physical activity (PAL), constant strain postures (CSP), standing time (ST) and lying time (LT)...
The following parameters of physical activity were recorded: time upright (standing or walking), time standing, time walking, and step count.